Which methods exist for efficient calculation of Elementary flux modes (EFMs) in genome-scale metabolic networks (GSMNs)?

The efficient calculation of elementary flux modes (EFMs) in genome-scale metabolic networks (GSMNs) is a challenge. Two methods for this task have been developed, eFM-ta and treeefm.